Infants in the newborn intensive care unit

The above is a clinical trial inclusion criterion. Annotated with entity spans:
[Person: Infants] in the [Visit: newborn intensive care unit]